Todas las siguientes enfermedades se pueden acompañar de esplenomegalia palpable, EXCEPTO una. Indique ésta última:
1. Linfoma no Hodgkin.
2. Mieloma múltiple.
3. Tricoleucemia.
4. Enfermedad de Gaucher.
5. Mielofibrosis con metaplasia mieloide.

Respuesta correcta: 2. Mieloma múltiple.